下面那一個真核細胞中蛋白質複合物，同時參與 RNA 轉錄及 DNA 修復功能？
A. TFIIA
B. TFIID
C. TFIIF
D. TFIIH

正確答案：D. TFIIH